Laura es una niña de 7 años diagnosticada desde hace 2 años de Diabetes Mellitus Tipo I. Hace 3 días comenzó clases de patinaje y tras ellas refiere cansancio, nerviosismo, temblores y cefalea. Al comentárselo a la enfermera del polideportivo donde realiza dicha actividad, la recomendación terapéutica por su parte sería:
1. Que controle la glucemia antes, durante y después del ejercicio.
2. Que deje el patinaje puesto que no sería bueno para el control de su enfermedad.
3. Que tome carbohidratos simples antes del ejercicio.
4. Que es normal sentirse así después de tanto deporte.

Respuesta correcta: 1. Que controle la glucemia antes, durante y después del ejercicio.